a crown-rump length = 6mm and no cardiac activity OR

The above is a clinical trial inclusion criterion. Annotated with entity spans:
a [Measurement: crown-rump length] [Value: = 6mm] and [Negation: no] [Observation: cardiac activity] OR